La estructura de la wurtzita está formada por:
1. Un empaquetamiento hexagonal compacto de iones sulfuro con los iones cinc ocupando todos los huecos octaédricos.
2. Un empaquetamiento hexagonal compacto de iones sulfuro con los iones cinc ocupando todos los huecos tetraédricos.
3. Un empaquetamiento hexagonal compacto de iones sulfuro con los iones cinc ocupando la mitad de los huecos tetraédricos de forma alternada.
4. Un empaquetamiento hexagonal compacto de iones sulfuro con los iones cinc ocupando la mitad de los huecos octaédricos de forma alternada.

Respuesta correcta: 3. Un empaquetamiento hexagonal compacto de iones sulfuro con los iones cinc ocupando la mitad de los huecos tetraédricos de forma alternada.